下列各消化管道，何者具黏膜下腺（submucosal glands），又稱為 Brunner's glands？
A. 胃
B. 十二指腸
C. 空腸
D. 迴腸

正確答案：B. 十二指腸